6. daily use of opioids for pain

The above is a clinical trial exclusion criterion. Annotated with entity spans:
6. [Multiplier: daily] use of [Drug: opioids] for [Condition: pain]